Clinical trial exclusion criterion:
7. Meet current DSM V criteria for moderate to severe substance use disorder (excluding nicotine), smoke daily, or urine toxicology positive for any illicit substance inconsistent with history given.

Entity relations:
- Has_negation("nicotine", "excluding")
- Has_qualifier("illicit substance", "inconsistent with history")
- Has_value("urine toxicology", "positive")
- AND("urine toxicology", "illicit substance")
- AND("substance use disorder", "nicotine")
- Has_qualifier("substance use disorder", "moderate to severe")
- AND("DSM V criteria", "substance use disorder")
- Has_value("DSM V criteria", "Meet")
- OR("smoke daily", "urine toxicology")